Clinical trial inclusion criterion:
Affiliation to a social security system or similar,

Annotated entities:
- Observation: "Affiliation to a social security system"